一位 48 歲患有輕度厭食症之女性因嗜睡和全身無力被送至急診室，身體檢查無異常發現，唯實驗室檢查發現血清鈉離子濃度為 114 meq/L。經緩慢的給予 3% NaCl 之高張鹽水（hypertonic saline）點滴注射，2 天後血清鈉離子濃度上升至 135 meq/L，患者意識恢復，無力症狀也改善。但再 3 天後患者突然發生四肢全癱，吞嚥與構音障礙，和半昏迷狀態。根據以上敘述，下列何者是此病人治療後最可能發生的併發症？
A. 腦下垂體中風（pituitary apoplexy）
B. 急性多發性神經炎
C. 中央橋腦髓鞘溶解症（central pontine myelinolysis）
D. 多發性硬化症（multiple sclerosis）急性復發

正確答案：C. 中央橋腦髓鞘溶解症（central pontine myelinolysis）